下列有關機化性肺炎（organizing pneumonia）的敘述，何者錯誤？
A. 肺泡中塞滿球狀之纖維母細胞增生（Masson body）
B. 病變不涉及小支氣管
C. 通常無間質性纖維化
D. 通常無蜂巢狀纖維化

正確答案：B. 病變不涉及小支氣管